Clinical trial exclusion criterion:
Current pulmonary exacerbation thought to be due to allergic bronchopulmonary aspergillosis (ABPA)

Annotated entities:
- Condition: "pulmonary exacerbation"
- Condition: "allergic bronchopulmonary aspergillosis"
- Condition: "ABPA"